Clinical trial exclusion criterion:
Anticoagulant therapy (e.g. Warfarin, Plavix, etc.), will not be automatic exclusion but patients will be required to have INR test performed and have values between 2.0 to 3. Physician consultation will be requested to determine whether anticoagulant therapy can be discontinued for 3 days prior to surgery.

Entity relations:
- Subsumes("Anticoagulant therapy", "Warfarin")
- Has_value("INR test", "between 2.0 to 3")
- AND("Anticoagulant therapy", "INR test")
- OR("Warfarin", "Plavix")